Clinical trial exclusion criterion:
Underlying chronic illness other than asthma (e.g. bronchiectasis, cyanotic congenital heart disease or cardiac failure, neuromuscular disorders, immunodeficiency) that could potentially influence the current illness

Annotated entities:
- Condition: "chronic illness"
- Negation: "other"
- Condition: "asthma"
- Condition: "bronchiectasis"
- Condition: "cyanotic congenital heart disease"
- Condition: "cardiac failure"
- Condition: "neuromuscular disorders"
- Condition: "immunodeficiency"